What is a benefit of being g6PD-deficient?

Increased resistance to malaria, reduces the risk of coronary diseases, beneficial effect in terms of longevity